not taking medications other than oral contraceptives

The above is a clinical trial inclusion criterion. Annotated with entity spans:
[Negation: not] taking [Drug: medications] [Negation: other than] [Drug: oral contraceptives]